下列有關遠視眼（hyperopia 或 hypermetropia）的敘述，何者較正確？
A. 遠視眼看遠處，是不必戴上眼鏡就可以看得清楚的
B. 遠視眼看近物，不戴眼鏡是看不清楚的
C. 遠視眼球的遠點（far point）位在無限遠（infinity）處
D. 足月（full term）新生兒（new-born）的眼球，絕大多數均為遠視眼

正確答案：D. 足月（full term）新生兒（new-born）的眼球，絕大多數均為遠視眼